Clinical trial exclusion criterion:
Patients with dexamethasone intolerance.

Entity relations:
- AND("intolerance", "dexamethasone")